下列關於鼻腔黏膜上之黏液毯的敘述，何者正確？
A. 主要是由呼吸上皮中的纖毛細胞之分泌物構成
B. 此黏液毯僅分布於鼻腔及鼻竇中，不存在於口咽及氣管中
C. 黏液毯可以吸附灰塵細菌及微小粒子，並隨著纖毛運動將這些物質往口咽部移動
D. 在酸性環境下，其纖毛運動及溶小體活性最佳

正確答案：C. 黏液毯可以吸附灰塵細菌及微小粒子，並隨著纖毛運動將這些物質往口咽部移動